Clinical trial inclusion criterion:
FIBRO Spect II index consistent with F3 or F4 AND an AST : platelet ration index (APRI) of > 2 during Screening

Entity relations:
- Has_value("platelet ration index (APRI)", "> 2")
- Has_value("FIBRO Spect II index", "F3 or F4")
- Has_value("FIBRO Spect II index", "AST")
- AND("FIBRO Spect II index", "platelet ration index (APRI)")
- Has_temporal("FIBRO Spect II index", "during Screening")